La deficiencia en una de las siguientes enzimas está causada por la alteración del cromosoma X; ¿cuál?:
1. Piruvato quinasa (PK)
2. Glucosa-6-fosfato deshidrogenasa (G6PDH).
3. Glucosa-fosfato lsomerasa (GPI)
4. 5´-Pirimidín nucleotidasa (5’N).

Respuesta correcta: 2. Glucosa-6-fosfato deshidrogenasa (G6PDH).